9. Severe arthritis or other problems that limit passive range of motion;

The above is a clinical trial exclusion criterion. Annotated with entity spans:
[Parsing_Error: 9.] [Condition: Severe arthritis] or other [Condition: problems that limit passive range of motion];